下列疾病中，何者與Epstein-Barr 病毒的感染最無關？
A. 鼻咽癌（nasopharyngeal carcinoma）
B. 慢性骨髓性白血病（chronic myelogenous leukemia）
C. 霍金氏疾病（Hodgkin's disease）
D. 布奇氏淋巴瘤（Burkitt's lymphoma）

正確答案：B. 慢性骨髓性白血病（chronic myelogenous leukemia）